一位懷孕週數 26 週的早產兒出院後，於出生後七個月大時到你的門診追蹤診察。他會發出ㄧㄨ聲音，但仍無 da ba 音。頭會轉向音源。俯臥時胸部和頭部可以抬起，但仍不會翻身。給他玩具會抓握，但仍不會主動伸手抓。你對他的評估是：
A. 粗動作發展遲緩
B. 細動作發展遲緩
C. 語言發展遲緩
D. 整體發展正常

正確答案：D. 整體發展正常